En el diagnóstico de salud de una comunidad, si se plantea como objetivo conocer cómo influye el entorno medioambiental en la comunidad, el indicador que se tiene que incluir en el análisis es:
1. Tasa de desempleo.
2. Características geográficas.
3. Estructura general de la población.
4. Tasa de fecundidad.
5. Población correctamente vacunada.

Respuesta correcta: 2. Características geográficas.